List human diseases involving genomic imprinting.

Prader Willi Syndrome
Angelman syndrome
Beckwith-Wiedemann syndrome
Hydatidiform mole
Cancer
Silver-Russell syndrome
Diabetes